Patients who do not give informed consent

The above is a clinical trial exclusion criterion. Annotated with entity spans:
[Non-query-able: Patients who do not give informed consent]